Clinical trial exclusion criterion:
any previous treatment for the for adhesive capsulitis of the affected shoulder.

Entity relations:
- Has_temporal("treatment", "previous")
- Has_qualifier("treatment", "any")
- AND("treatment", "adhesive capsulitis")
- Has_qualifier("adhesive capsulitis", "affected shoulder")